Adults (= 18 years of age) with World Health Organization Group 2 Pulmonary Hypertension (Mean pulmonary artery pressure = 25 mmHg and pulmonary capillary wedge pressure = 15 mmHg)

The above is a clinical trial inclusion criterion. Annotated with entity spans:
[Person: Adults] ([Value: = 18 years] of [Person: age]) with [Qualifier: World Health Organization Group 2] [Condition: Pulmonary Hypertension] [Measurement: (Mean pulmonary artery pressure] [Value: = 25 mmHg] and [Measurement: pulmonary capillary wedge pressure] [Value: = 15 mmHg])